實驗性研究（experimental study）與觀察性研究（observational study）的主要不同點，在於實驗性研究有下列何種特色，而觀察性研究則無？
A. 以有病的患者為對象
B. 可以進行前瞻性的觀察
C. 只能研究對人體健康有益的因子
D. 由研究者分配暴露因子

正確答案：D. 由研究者分配暴露因子